10歲女童小華，患有皮膚疹已經三個月，經醫師診斷為慢性蕁麻疹(Urticaria)，下列敘述何者錯誤？
A. 診斷慢性蕁麻疹時，病人症狀反覆發生須超過 6星期
B. 抽血通常有很高的機率找出過敏原
C. 蕁麻疹分為急性和慢性，兩者形成機轉和治療方式不同
D. 慢性蕁麻疹之病患血中之IgE抗體，不一定會升高

正確答案：B. 抽血通常有很高的機率找出過敏原